Clinical trial inclusion criteria:
Age between 20 and 80 years
Patients undergoing percutaneous coronary intervention and need to take dual antiplatelet therapy continuously at least 12weeks
Modified Lanza Score grade 0-1 measured by upper gastrointestinal endoscopy
mild gastrointestinal symptom
Creatinen in blood = 3mg/dl
BUN = 50mg/dl
Birilubin = 3mg/dl
AST and ALT = 80U/L

Annotated entities:
- Person: "Age"
- Value: "between 20 and 80 years"
- Procedure: "percutaneous coronary intervention"
- Procedure: "dual antiplatelet therapy"
- Qualifier: "continuously"
- Temporal: "at least 12weeks"
- Measurement: "Modified Lanza Score grade"
- Value: "0-1"
- Procedure: "upper gastrointestinal endoscopy"
- Condition: "gastrointestinal symptom"
- Qualifier: "mild"
- Measurement: "Creatinen"
- Value: "= 3mg/dl"
- Measurement: "BUN"
- Value: "= 50mg/dl"
- Measurement: "Birilubin"
- Value: "= 3mg/dl"
- Measurement: "AST"
- Measurement: "ALT"
- Value: "= 80U/L"